Involved in another interventional study

The above is a clinical trial exclusion criterion. Annotated with entity spans:
[Competing_trial: Involved in another interventional study]